Clinical trial inclusion criterion:
Age over 18 years,

Entity relations:
- Has_value("Age", "over 18 years")